Clinical trial inclusion criterion:
Age= 18 and= 75 years

Annotated entities:
- Person: "Age"
- Value: "= 18 and= 75 years"